Clinical trial inclusion criterion:
Pretreatment with any CYP3A inducers or inhibitors

Annotated entities:
- Procedure: "Pretreatment"
- Drug: "CYP3A inducers"
- Drug: "CYP3A inhibitors"